El deseo del paciente a no ser informado:
1. Está regulado por la ley solo para casos excepcionales.
2. No está regulado en ningún extremo por la ley.
3. La obligación profesional es informarle siempre aunque no quiera.
4. Es un derecho que la ley otorga a todas las personas.
5. Hay que comunicarlos a la autoridad judicial.

Respuesta correcta: 4. Es un derecho que la ley otorga a todas las personas.